Clinical trial exclusion criterion:
Systemic administration of corticosteroids (PO/IV/IM) within 90 days prior to informed consent.

Entity relations:
- Subsumes("Systemic administration", "PO")
- Has_qualifier("corticosteroids", "Systemic administration")
- Has_index("within 90 days prior to informed consent", "informed consent")
- Has_temporal("Systemic administration", "within 90 days prior to informed consent")
- OR("PO", "IV", "IM")